El test BETA (Revisado) (Kellog y Morton, 1999):
1. No aporta una puntuación de CI.
2. No mide la capacidad verbal, pero está altamente influenciado por ella.
3. Se puede aplicar a personas con un nivel cultural muy bajo.
4. Consta de 16 subtests.

Respuesta correcta: 3. Se puede aplicar a personas con un nivel cultural muy bajo.